Patients with prior fistulotomy, fistulectomy, LIFT, cutting seton or advancement flap procedure

The above is a clinical trial exclusion criterion. Annotated with entity spans:
Patients with prior [Procedure: fistulotomy], [Procedure: fistulectomy], [Procedure: LIFT], [Procedure: cutting seton] or [Procedure: advancement flap procedure]